Clinical trial exclusion criterion:
long-term use of analgesics,sedatives or non steroidal anti-inflammatory drugs history.

Entity relations:
- Has_temporal("non steroidal anti-inflammatory drugs", "history")
- Has_multiplier("analgesics", "long-term use")
- OR("analgesics", "sedatives")
- OR("analgesics", "non steroidal anti-inflammatory drugs")